Clinical trial exclusion criterion:
Active consumption of alcohol and/or drugs

Annotated entities:
- Condition: "consumption of alcohol"
- Condition: "drugs consumption of"
- Qualifier: "Active"